Symptomatic bradycardia or second- or third-degree atrioventricular block without a pacemaker.

The above is a clinical trial exclusion criterion. Annotated with entity spans:
Symptomatic [Condition: bradycardia] or [Qualifier: second-] or [Qualifier: third-degree] [Condition: atrioventricular block] [Negation: without] a [Device: pacemaker].